Clinical trial inclusion criterion:
Mental or nervous system disorders.

Entity relations:
- OR("Mental disorders", "nervous system disorders")